一位65歲女性病患，左鼻孔流血，經局部填塞法止血後，第3天取出填塞紗條又大出血，再經後鼻孔、鼻腔內填塞止血，3天後仍大量流鼻血，故決定以外頸動脈結紮法處置，但不幸地，結紮後仍然鼻出血，最可能出血之血管為何？
A. 蝶顎動脈（sphenopalatine artery）之分支
B. 前篩動脈（anterior ethmoid artery）
C. 大顎動脈（greater palatine artery）
D. 上唇動脈（superior labial artery）

正確答案：B. 前篩動脈（anterior ethmoid artery）